Clinical trial exclusion criterion:
Underlying chronic liver disease (hemochromatosis, liver cell carcinoma, autoimmune liver disease, liver cirrhosis, chronic viral hepatitis)

Annotated entities:
- Condition: "chronic liver disease"
- Condition: "hemochromatosis"
- Condition: "liver cell carcinoma"
- Condition: "autoimmune liver disease"
- Condition: "liver cirrhosis"
- Condition: "chronic viral hepatitis"